En una cromatografía de partición (reparto) en fase normal:
1. La fase estacionaria es altamente apolar.
2. La fase móvil es relativamente no-polar.
3. Primero eluyen los solutos más polares.
4. Al incrementar la polaridad de la fase móvil aumentan los tiempos de elución.

Respuesta correcta: 2. La fase móvil es relativamente no-polar.